El factor de selectividad de una columna cromatografía para dos solutos A y B se define como la relación entre:
1. La fracción de tiempo que pasa el soluto A en la fase móvil y el tiempo que pasa el soluto B en la estacionaria.
2. Las actividades de los solutos A y B en la fase estacionaria.
3. Las concentraciones molares de A y B en cualquier de las fases en un momento determinado de la separación.
4. La constante de distribución de B (soluto más retenido) con respecto a la de A (soluto menos retenido).

Respuesta correcta: 4. La constante de distribución de B (soluto más retenido) con respecto a la de A (soluto menos retenido).